What is the CRAPome database?

The CRAPome is a contaminant repository for affinity purification-mass spectrometry data.